下列何者不是手術適應症？
A. intraperitoneal free air
B. pneumatosis intestinalis
C. acidosis (pH < 7.20) after fluid resuscitation
D. hepatoportal venous gas

正確答案：B. pneumatosis intestinalis